Clinical trial exclusion criterion:
Patients with signs or symptoms of SVC syndrome, or hepatic cirrhosis not felt due to passive congestion from TR.

Entity relations:
- AND("hepatic cirrhosis", "passive congestion from TR")
- OR("SVC syndrome", "hepatic cirrhosis")